¿En cuál de los siguientes tipos de glomerulonefritis existe una mayor indicación de IECAS o ARA-II como tratamiento antiproteinúrico?
1. Glomeruloesclerosis segmentaria y focal secundaria a hiperfiltración.
2. Glomerulonefritis aguda postinfecciosa.
3. Glomerulonefritis extracapilar.
4. Glomerulonefritis por cambios mínimos.
5. Glomerulonefritis membranoproliferativa.

Respuesta correcta: 1. Glomeruloesclerosis segmentaria y focal secundaria a hiperfiltración.